裸鼠（nude mice）有嚴重的免疫缺損，請問裸鼠的免疫缺損和下列那一種人類的疾病最類似？
A. DiGeorge syndrome
B. common variable immunodeficiency
C. severe combined immunodeficiency
D. Omenn syndrome

正確答案：A. DiGeorge syndrome